Habitual bedtimes after 3 AM, habitual rise times after 10 AM, or habitual napping > 1hour/day;

The above is a clinical trial exclusion criterion. Annotated with entity spans:
[Non-query-able: Habitual bedtimes after 3 AM, habitual rise times after 10 AM, or habitual napping > 1hour/day];